Clinical trial inclusion criteria:
Patients undergoing an operation that is scheduled to last more than 2 hours

Annotated entities:
- Procedure: "operation"
- Qualifier: "scheduled to last more than 2 hours"
- Temporal: "last more than 2 hours"
- Undefined_semantics: "scheduled to last more than 2 hours"
- Non-query-able: "scheduled to last more than 2 hours"